Clinical trial inclusion criterion:
Are negative for human immunodeficiency virus (HIV) infection at screening

Annotated entities:
- Condition: "human immunodeficiency virus (HIV)"
- Negation: "negative"
- Temporal: "at screening"